一位 50 歲男性病人，有糖尿病史，一直在家醫科門診追蹤。兩天前開始有發燒、咳嗽，做了血糖及全血球檢查；空腹血糖為 124 mg/dL，血色素為 16.8 g/dL，白血球數為 32,260/μL，中性球 25%，淋巴球 69.5%，單核球 4%，嗜伊紅性血球 1%，嗜鹼性血球 0.5％，血小板為 190,000/μL。流式細胞儀檢查顯示淋巴球為 CD19、CD20、CD5 及κ-light chain 陽性，CD3 及λ-light chain 為陰性。下列 何者是此病人最可能的診斷？
A. common cold associated lymphocytosis
B. Epstein-Barr virus infection induced lymphocytosis
C. systemic tuberculosis induced lymphocytosis
D. B-cell chronic lymphocytic leukemia

正確答案：D. B-cell chronic lymphocytic leukemia